Clinical trial exclusion criterion:
Serum potassium >5.0 molar equivalent/L

Entity relations:
- Has_value("Serum potassium", ">5.0 molar equivalent/L")